Clinical trial inclusion criterion:
Immunocompetence*

Annotated entities:
- Condition: "Immunocompetence"